Clinical trial inclusion criterion:
HbA1c = 9% if on triple therapy or = 10% on diet & exercise or monotherapy or dual therapy

Entity relations:
- Has_value("HbA1c", "= 9%")
- OR("= 9%", "= 10%")